3. Weighing at least 50 kg

The above is a clinical trial inclusion criterion. Annotated with entity spans:
[Parsing_Error: 3.] [Measurement: Weighing] [Value: at least 50 kg]